Clinical trial exclusion criterion:
Patient with history of allergy in any kind anesthetic drug

Annotated entities:
- Condition: "allergy"
- Drug: "anesthetic drug"
- Qualifier: "any kind"
- Temporal: "history"